陳先生是一位 45 歲有吸菸習慣的業務員，平日無身體不適，他的一位同事在 1 個月前因為攝護腺癌接受手術治療，使他對自己的健康狀況產生焦慮，找他的家庭醫師作攝護腺癌的檢查。你如果是陳先生的家庭醫師，你認為最符合實證醫學的處理方式為何？
A. 陳先生目前無攝護腺癌檢查的必要
B. 陳先生有吸菸習慣，有必要作攝護腺特異性抗原（prostate-specific antigen）檢查
C. 肛門指診敏感度低，陳先生需接受經直腸超音波檢查
D. 陳先生已步入中年，有必要作攝護腺特異性抗原檢查

正確答案：A. 陳先生目前無攝護腺癌檢查的必要